Clinical trial inclusion criterion:
written informed consent obtained

Annotated entities:
- Post-eligibility: "written informed consent obtained"